Clinical trial inclusion criterion:
Current diagnosis of bipolar disorder or schizophrenia on structured interview (MINI Plus)

Annotated entities:
- Condition: "bipolar disorder"
- Condition: "schizophrenia"
- Measurement: "structured interview"
- Measurement: "MINI Plus"